List features of the Currarino triad.

Currarino syndrome is a congenital malformation syndrome typically characterized by sacral agenesis, anorectal malformation, and presence of a pre-sacral mass.